根據美國國家衛生院的研究，胰島素瘤（insulinoma）的手術前定位以下列何者最為精確？
A. 手術前核磁共振檢查
B. 手術前血管造影術
C. 手術前以鈣劑動脈注射刺激試
D. 手術中超音波掃描

正確答案：C. 手術前以鈣劑動脈注射刺激試